¿Cuál de los siguientes antifúngicos se emplea en el tratamiento de la aspergilosis invasiva y de las candidiasis graves incluyendo Candida krusei y Candida glabrata?:
1. Voriconazol.
2. Miconazol.
3. Ketoconazol.
4. Fluconazol.
5. 1 y 3 son correctas.

Respuesta correcta: 1. Voriconazol.